Clinical trial exclusion criterion:
Severe uncorrected insulin insufficiency

Entity relations:
- Has_qualifier("insulin insufficiency", "uncorrected")
- Has_qualifier("insulin insufficiency", "Severe")